Clinical trial inclusion criterion:
Patients aged =50 years with DM2 and symptomatic PAD diagnosed clinically (according to Fontaine criteria, stage IIa or IIb and III) and by measuring the <U+0391><U+0392><U+0399>.

Annotated entities:
- Person: "aged"
- Value: "=50 years"
- Condition: "DM2"
- Condition: "PAD"
- Qualifier: "symptomatic"
- Measurement: "Fontaine criteria"
- Value: "stage IIa or IIb and III"
- Non-representable: "by measuring the <U+0391><U+0392><U+0399>"